Clinical trial inclusion criterion:
Written informed consent from participating patients

Annotated entities:
- Informed_consent: "Written informed consent from participating patients"